¿Cuál de las siguientes combinaciones de fármacos se utiliza habitualmente en el tratamiento de mantenimiento de los pacientes portadores de un trasplante renal?
1. Tacrolimus, ciclosporina y        micofenolato mofetilo.
2. Tacrolimus, micofenolato          mofetilo      y glucocorticoides.
3. Tacrolimus, sirolimus y           micofenolato mofetilo.
4. Tacrolimus, azatioprina y         micofenolato mofetilo.
5. Ciclosporina, azatioprina y       micofenolato mofetilo.

Respuesta correcta: 2. Tacrolimus, micofenolato          mofetilo      y glucocorticoides.